A un paciente con un episodio agudo de gota, la enfermera debe recomendarle:
1. Evitar comidas ricas en grasas y en calorías.
2. Aplicar bolsas de hielo para disminuir el dolor articular.
3. Realizar ejercicio diario.
4. Evitar la ingesta de alimentos ricos en purinas.
5. Controlar periódicamente el hemograma y el recuento leucocitario.

Respuesta correcta: 4. Evitar la ingesta de alimentos ricos en purinas.